3. The subject will have been on insulin pump therapy for at least 3 months and currently using a fast actin insulin analog (Lispro, Aspart or Guilisine).

The above is a clinical trial inclusion criterion. Annotated with entity spans:
[Parsing_Error: 3.] The subject will have been on [Procedure: insulin pump therapy] [Temporal: for at least 3 months] and [Temporal: currently] using a [Drug: fast actin insulin analog] ([Drug: Lispro], [Drug: Aspart] or [Drug: Guilisine]).